HIV co-infection if on a protease inhibitor based regimen

The above is a clinical trial exclusion criterion. Annotated with entity spans:
[Condition: HIV co-infection] if on a [Drug: protease inhibitor] based regimen